Clinical trial exclusion criterion:
6. Use of systemic steroids within 1 month of study entry

Entity relations:
- Has_index("within 1 month of study entry", "study entry")
- Has_temporal("systemic steroids", "within 1 month of study entry")